What is the prevalence of short QT syndrome?

The prevalence of short QT syndrome is low and varies between 0.01% and 0.1%